Patients with concomitant HIV infection or congenital immune deficiency diseases.

The above is a clinical trial exclusion criterion. Annotated with entity spans:
Patients with [Qualifier: concomitant] [Condition: HIV infection] or [Condition: congenital immune deficiency diseases].